Clinical trial exclusion criterion:
Patients with a seizure history, history of recurrent falls, or known brain metastases are excluded from this clinical trial because of their poor prognosis and because of their heightened risk of seizure or progressive cognitive and/or neurologic dysfunction that would confound the evaluation.

Entity relations:
- Has_temporal("recurrent falls", "history of")
- Has_temporal("seizure", "history")
- OR("seizure", "brain metastases", "recurrent falls")